Clinical trial exclusion criterion:
Pregnant (as evidenced by positive pregnancy test) or nursing women

Entity relations:
- Has_value("pregnancy test", "positive")
- Subsumes("Pregnant", "pregnancy test")
- OR("Pregnant", "nursing")